Clinical trial exclusion criterion:
6. Concurrent use of any testosterone, progestin, androgen, estrogen, anabolic steroids, DHEA or hormonal products for at least 2 weeks prior to screening and during the study.

Annotated entities:
- Parsing_Error: "6."
- Drug: "testosterone"
- Drug: "progestin"
- Drug: "androgen"
- Drug: "estrogen"
- Drug: "anabolic steroids"
- Drug: "DHEA"
- Temporal: "for at least 2 weeks prior to screening"
- Temporal: "during the study"
- Reference_point: "screening"
- Drug: "hormonal products"
- Undefined_semantics: "hormonal products"